下列對於 Hypersensitivity pneumonitis 之敘述，何者不對？
A. 吸入有機物質，產生過敏性肺泡炎（allergic alveolitis）
B. 在肺泡沖洗液內，T lymphocytes 增加
C. 血液中之 eosinophils 增加
D. 治療方式為避免環境暴露，再給予類固醇治療其炎症

正確答案：C. 血液中之 eosinophils 增加